一位 24 歲女孩因為月經不規則來門診求診，主訴初經為 12 歲來，但是最近 6 個月都沒有月經。體 型胖，有多毛症及青春痘，何種診斷最不可能？
A. 子宮頸癌
B. 多囊性卵巢
C. 早發性卵巢衰竭
D. 懷孕

正確答案：A. 子宮頸癌